Clinical trial exclusion criterion:
Patients with a current seizure disorder, organic brain disorder or a history of seizure disorders (except for febrile seizures in childhood).

Entity relations:
- Has_qualifier("febrile seizures", "childhood")
- Has_negation("febrile seizures", "except")
- AND("history of seizure disorders", "febrile seizures")
- OR("seizure disorder", "organic brain disorder", "history of seizure disorders")